Clinical trial inclusion criterion:
Non-obese: defined as BMI less than 28 kg/m2

Annotated entities:
- Negation: "Non"
- Condition: "obese"
- Measurement: "BMI"
- Value: "less than 28 kg/m2"